Subjects who can not stop treatment with topical steroids (group 1~5), oral antibiotics, whole body photochemotherapy, immunosuppressive drug within 4 weeks before the treatment visit

The above is a clinical trial exclusion criterion. Annotated with entity spans:
Subjects who [Non-query-able: can not stop] treatment with [Drug: topical steroids] ([Context_Error: group 1~5]), [Drug: oral antibiotics], [Procedure: whole body photochemotherapy], [Drug: immunosuppressive drug] [Temporal: within 4 weeks before] the [Reference_point: treatment visit]